What is maternal spindle transfer?

Maternal spindle transfer (MST) is a cutting edge germline-altering, IVF-based embryonic technique used to prevent the maternal transmission of serious mitochondrial diseases.